Clinical trial inclusion criterion:
Bilirubin <1.25 times the upper limit of normal (ULN)

Annotated entities:
- Measurement: "Bilirubin"
- Value: "<1.25 times the upper limit of normal"